Clinical trial inclusion criterion:
Patients weighing = 80 pounds who are not -intubated prior to surgery,

Annotated entities:
- Measurement: "weighing"
- Value: "= 80 pounds"
- Negation: "not"
- Procedure: "intubated"
- Temporal: "prior to surgery"
- Reference_point: "surgery"
- Procedure: "surgery"